有關精索（spermatic cord）的敘述，下列何者錯誤？
A. 外包三層筋膜（fascia）
B. 內有睪丸動脈（testicular artery）及輸精管（ductus deferens）
C. 內有蔓狀靜脈叢（pampiniform venous plexus）
D. 內無淋巴管（lymphatic vessels）

正確答案：D. 內無淋巴管（lymphatic vessels）